Previously enrolled

The above is a clinical trial exclusion criterion. Annotated with entity spans:
[Competing_trial: Previously enrolled]